Clinical trial exclusion criterion:
pregnant or nursing woman

Annotated entities:
- Condition: "pregnant"
- Condition: "nursing"
- Person: "woman"